Clinical trial exclusion criterion:
patients with previous surgery of the cervix (conization);

Annotated entities:
- Procedure: "surgery"
- Qualifier: "cervix"
- Procedure: "conization"